中樞神經受傷造成的上肢肌肉痙攣（spasticity），下列何種治療具有最佳效果？
A. 物理治療
B. 藥物治療
C. 輔具矯正
D. 針灸治療

正確答案：B. 藥物治療